Bilirubin <2.0 mg/dl or SGOT <3.0 X the upper limit of normal.

The above is a clinical trial inclusion criterion. Annotated with entity spans:
[Measurement: Bilirubin] [Value: <2.0 mg/dl] or [Measurement: SGOT] [Value: <3.0 X the upper limit of normal].